Participation in another clinical trial within 30 days of the screening visit;

The above is a clinical trial exclusion criterion. Annotated with entity spans:
[Competing_trial: Participation in another clinical trial within 30 days of the screening visit];